Subjects were not to have any history or presence or family history of schizophrenia, other psychotic illness, severe personality disorder, depression, or other significant psychiatric disorder.

The above is a clinical trial exclusion criterion. Annotated with entity spans:
Subjects were not to have any [Temporal: history] or [Observation: presence] or [Observation: family history] of [Condition: schizophrenia], other [Condition: psychotic illness], [Condition: severe personality disorder], [Condition: depression], or other [Undefined_semantics: significant psychiatric disorder].